Clinical trial exclusion criterion:
Known or suspected hypersensitivity to either propofol, e.g. egg or soy allergy, or volatile general anesthetic agents

Annotated entities:
- Mood: "Known"
- Mood: "suspected"
- Condition: "hypersensitivity"
- Drug: "propofol"
- Drug: "egg"
- Drug: "soy"
- Condition: "allergy"
- Drug: "volatile general anesthetic agents"